Clinical trial inclusion criterion:
Cephalic presentation

Annotated entities:
- Condition: "Cephalic presentation"